Clinical trial inclusion criterion:
Diagnosis: Major depression, unipolar (by Structured Clinical Interview for Diagnostic and Statistical Manual (DSM)IV (SCID-R) and DSM-IV criteria);

Entity relations:
- Has_qualifier("Major depression", "unipolar")
- Subsumes("IV Structured Clinical Interview for Diagnostic and Statistical Manual", "DSM")
- AND("IV Structured Clinical Interview for Diagnostic and Statistical Manual", "Major depression")
- OR("DSM", "SCID")